Clinical trial exclusion criterion:
Any debilitating disease prior to the SCI that caused exercise intolerance

Entity relations:
- Has_index("prior to the SCI", "the SCI")
- Has_temporal("debilitating disease", "prior to the SCI")
- AND("debilitating disease", "exercise intolerance")